Clinical trial exclusion criterion:
History of intracranial hypertension

Annotated entities:
- Temporal: "History"
- Condition: "intracranial hypertension"